Clinical trial exclusion criterion:
Receiving antimicrobial therapy to treat non-tuberculous mycobacterium (e.g., M. abscessus, M. avium complex) in the two weeks prior to Visit 2

Entity relations:
- Has_qualifier("antimicrobial therapy", "non-tuberculous mycobacterium")
- Subsumes("non-tuberculous mycobacterium", "M. abscessus")
- Subsumes("non-tuberculous mycobacterium", "M. avium complex")
- Has_index("in the two weeks prior to Visit 2", "Visit 2")
- Has_temporal("antimicrobial therapy", "in the two weeks prior to Visit 2")